Clinical trial inclusion criterion:
Condomless sex in the last 3 months with one or more male partners of unknown HIV status known to be at substantial risk of HIV infection (IDU, bisexual, sex for goods, recently incarcerated, from a country with HIV prevalence >1%, interpersonal Partner Violence);

Entity relations:
- Has_temporal("Condomless sex", "in the last 3 months")
- multi("substantial risk of HIV infection", "HIV infection")
- Has_context("unknown HIV status", "substantial risk of HIV infection")
- Has_multiplier("male partners", "one or more")
- AND("male partners", "unknown HIV status")
- AND("Condomless sex", "male partners")